Clinical trial exclusion criterion:
Clinically significant agitation /aggression for which either 1) the frequency of agitation /aggression as assessed by the NPI is 'Very frequently', or 2) the frequency of agitation /aggression as assessed by the NPI is 'Frequently' AND the severity of the agitation as assessed by the NPI is 'Moderate', or 'Marked'

Entity relations:
- Has_qualifier("agitation /aggression", "Clinically significant")
- AND("frequency of agitation /aggression", "agitation /aggression")
- AND("frequency of agitation /aggression", "NPI")
- Has_value("NPI", "Very frequently")
- AND("frequency of agitation /aggression", "agitation /aggression")
- Has_value("NPI", "Frequently")
- Has_value("NPI", "Moderate")
- AND("severity of the agitation", "agitation")
- AND("severity of the agitation", "NPI")
- AND("frequency of agitation /aggression", "NPI")
- Has_multiplier("agitation /aggression", "frequency of agitation /aggression")
- OR("Moderate", "Marked")
- OR("frequency of agitation /aggression", "frequency of agitation /aggression", "severity of the agitation")